下列何者是 M. tuberculosis 對 isoniazid 產生抗藥性的主要機轉？
A. 減少 N-acetyltransferase 的活性
B. 減少 katG 基因的表現
C. 減少細胞的 isoniazid 的濃度
D. 造成 inh A 基因的突變

正確答案：B. 減少 katG 基因的表現